Clinical trial inclusion criterion:
Age of = 18 years of age and able to give written informed consent;

Entity relations:
- Has_value("Age", "= 18 years")